Clinical trial exclusion criterion:
A positive reaction for HIV infection, viral hepatitis B and hepatitis C;

Annotated entities:
- Measurement: "reaction for HIV infection"
- Value: "positive"
- Measurement: "reaction for viral hepatitis B"
- Measurement: "reaction for hepatitis C"